Clinical trial inclusion criterion:
echocardiographic structural (a left atrial volume index > 34 mL/m2 or a left ventricular mass index =115 g/m2 for males and =95 g/m2 for females) or functional alterations (E/e'=13 and a mean e' septal and lateral wall < 9 cm/s).

Entity relations:
- Has_value("left ventricular mass index", "=115 g/m2")
- AND("left ventricular mass index", "males")
- Has_value("left ventricular mass index", "=95 g/m2")
- AND("left ventricular mass index", "females")
- Has_value("E/e'", "=13")
- Has_value("mean e' septal and lateral wall", "< 9 cm/s")
- Subsumes("functional alterations", "E/e'")
- Has_value("left atrial volume inde", "> 34 mL/m2")
- Subsumes("echocardiographic structural", "left atrial volume inde")
- Subsumes("functional alterations", "mean e' septal and lateral wall")
- OR("left atrial volume inde", "left ventricular mass index", "left ventricular mass index")